Clinical trial exclusion criterion:
high blood pressure >180 systolic, 105, diastolic

Entity relations:
- Has_value("blood pressure diastolic", "105")
- Has_value("blood pressure systolic", ">180")